Como inmunosupresor, la rapamicina:
1. Inhibe la transcripción de la IL-2.
2. Inhibe la síntesis nueva de nucleótidos con guanina.
3. Bloquea las vías coestimuladoras del linfocito T.
4. Bloquea la proliferación de linfocitos T.

Respuesta correcta: 4. Bloquea la proliferación de linfocitos T.